Individuals with cochlear implants

The above is a clinical trial exclusion criterion. Annotated with entity spans:
Individuals with [Device: cochlear implants]